Women subjected to ICSI through controlled ovarian hyperstimulation (COH) with pituitary downregulation by GnRH antagonist.

The above is a clinical trial inclusion criterion. Annotated with entity spans:
[Person: Women] subjected to [Procedure: ICSI] through controlled [Procedure: ovarian hyperstimulation] ([Procedure: COH]) with [Procedure: pituitary downregulation] by [Procedure: GnRH antagonist].